注意力不集中過動症（attention-deficit/hyperactivity disorder；ADHD）典型的診斷條件，不包括下列何者？
A. 注意力不足（inattention）
B. 過動（hyperactivity）
C. 衝動（impulsivity）
D. 智能不足（mental retardation）

正確答案：D. 智能不足（mental retardation）